What is the drug chloroquine or hydroxychloroquine used for?

Chloroquine (CQ) has been used for decades as the primary chemotherapeutic drug for the treatment of malaria.
Hydroxychloroquine (HCQ), a 4-aminoquinolone antimalarial, is regarded as the oral therapy of choice for cutaneous and systemic lupus erythematosus (SLE). It is also licensed for rheumatoid arthritis (RA).
Chloroquine is a potent inhibitor of SARS coronavirus infection and spread.